Clinical trial exclusion criterion:
Pregnant

Annotated entities:
- Condition: "Pregnant"